The MMR vaccine protects against what 3 viruses?

measles, mumps and rubella (mmr) vaccine .